下列何者為盛行於北美洲密西西比河流域，兩型性（dimorphic）全身感染性真菌？
A. Blastomyces dermatitidis and Histoplasma capsulatum
B. Coccidioides immitis and Paracoccidioides brasiliensis
C. Paracoccidioides brasiliensis and Histoplasma capsulatum
D. Blastomyces dermatitidis  and Paracoccidioides brasiliensis

正確答案：A. Blastomyces dermatitidis and Histoplasma capsulatum